Clinical trial exclusion criterion:
not noticed as bipolar disorder

Entity relations:
- Has_mood("bipolar disorder", "noticed")
- Has_negation("bipolar disorder", "not")